Clinical trial exclusion criterion:
- Irregular menstrual cycle demanding preparing endometrium with hormones for frozen-thawed embryo

Annotated entities:
- Condition: "Irregular menstrual cycle"
- Procedure: "preparing endometrium with hormones for frozen-thawed embryo"